Clinical trial exclusion criterion:
known or presumed liver or renal dysfunction

Entity relations:
- Has_qualifier("liver dysfunction", "known")
- OR("known", "presumed")
- OR("liver dysfunction", "renal dysfunction")